Cardiac dysrhythmia precluding treatment with domperidone or apomorphine (increased QTc = 440 ms in men, QTc = 450 ms in women)

The above is a clinical trial exclusion criterion. Annotated with entity spans:
[Condition: Cardiac dysrhythmia] [Negation: precluding] treatment with [Drug: domperidone] or [Drug: apomorphine] (increased [Measurement: QTc] [Value: = 440 ms] in [Person: men], [Measurement: QTc] [Value: = 450 ms] in [Person: women])